Clinical trial exclusion criterion:
or they are receiving regular physical rehabilitation at present;

Annotated entities:
- Procedure: "regular physical rehabilitation"
- Temporal: "at present"